Clinical trial inclusion criteria:
Children aging between 3 and 6 years
presenting good health conditions
whose parents or legal guardians accept and sign the consent form
with at least one occlusal or occlusal proximal caries lesion in primary molars
only occlusal and/or occlusal-proximal surfaces with caries lesions with dentin involvement

Annotated entities:
- Person: "Children"
- Person: "aging"
- Value: "between 3 and 6 years"
- Condition: "good health conditions"
- Informed_consent: "whose parents or legal guardians accept and sign the consent form"
- Multiplier: "at least one"
- Qualifier: "occlusal proximal"
- Qualifier: "occlusal"
- Condition: "caries lesion"
- Qualifier: "primary molars"
- Condition: "caries lesions"
- Condition: "dentin involvement"
- Qualifier: "occlusal-proximal surfaces"
- Qualifier: "occlusal surfaces"